治療偏頭痛的triptans類藥物是影響到5HT的那個受體？ ①1A ②1B ③1C ④1D
A. ①③
B. ②④
C. ①④
D. ②③

正確答案：B. ②④